Los átomos de hidrógeno con carga parcial positiva de una molécula de agua pueden interaccionar con los átomos de oxígeno, con carga parcial negativa de otra molécula de agua. ¿Qué nombre recibe esta interacción? :
1. Hidrofóbica.
2. Polar.
3. Puente de Hidrógeno.
4. Van der Wall.
5. Zwitterion.

Respuesta correcta: 3. Puente de Hidrógeno.